Patients with anticipated difficult airway management (as this may require medications and/or airway manipulations resulting in increased IOP)

The above is a clinical trial exclusion criterion. Annotated with entity spans:
Patients with anticipated [Observation: difficult airway management] (as this may require medications and/or airway manipulations resulting in increased IOP)